一位 30 歲女子，抱怨近十多年來，腦海中會反覆出現遲疑的想法，擔心水龍頭關不好、擔心瓦斯關不緊、擔心門窗沒關好，這樣的反覆想法讓她感到焦慮。她抱怨每次出門與睡前，會反覆的關水龍頭、瓦斯、門窗，每次至少花 40 分鐘，這些問題造成她辭去工作、人際退縮與心情憂鬱。下列關於此病人的描述，何者最正確？
A. 這種疾病的主要原因為壓力所造成，心理動力心理治療（psychodynamic psychotherapy）對大多數此類病人的療效佳
B. 這種疾病主要之生物學原因為腎上腺素分泌過多所造成
C. 這種病人一定有強迫型的人格疾患（obsessive-compulsive personality disorder）
D. 因某種誘發事件而導致此類病情發作者之預後較佳

正確答案：D. 因某種誘發事件而導致此類病情發作者之預後較佳